Which is the main gene signature in Systemic Lupus Erythematosus (SLE)?

Systemic Lupus Erythematosus (SLE) has a type I interferon (IFN) gene signature.